En el tratamiento inicial de la esquizofrenia se recomienda la utilización de medicación antipsicótica de segunda generación porque:
1. Eliminan completamente la sintomatología negativa.
2. No interfieren en el funcionamiento cognitivo.
3. Tienen mejor tolerancia y un menor riesgo de discinesia tardía.
4. No aumentan el riesgo de desarrollar un síndrome metabólico.

Respuesta correcta: 3. Tienen mejor tolerancia y un menor riesgo de discinesia tardía.